La hipoxia hipoxémica se produce cuando:
1. Se dificulta la difusión pulmonar de oxígeno.
2. Hay disminución del flujo sanguíneo por shock cardiogénico.
3. La disminución de hemoglobina por anemia evita su transporte.
4. La membrana celular se encuentra alterada y no puede utilizar el oxígeno.
5. Ninguna es correcta.

Respuesta correcta: 1. Se dificulta la difusión pulmonar de oxígeno.